Clinical trial exclusion criterion:
Significant hepatic impairment (Serum GPT > 120 U/L).

Annotated entities:
- Condition: "hepatic impairment"
- Qualifier: "Significant"
- Measurement: "Serum GPT"
- Value: "> 120 U/L"